What is Behçet's disease

behçet's disease (bd) is a complex chronic relapsing inflammatory disorder of unknown etiology.